下列有關腹膜腔積氣（Pneumoperitoneum）之描述，那一項有誤？
A. 胃或十二指腸潰瘍為成人自發性腹膜腔積氣的最多原因
B. 仰臥腹部 X 光攝影比站立胸部 X 光攝影（Chest PA）更易於偵測腹膜腔積氣
C. 電腦斷層攝影可用於偵測腹膜腔積氣
D. 超音波掃描可偵測腹膜腔積氣

正確答案：B. 仰臥腹部 X 光攝影比站立胸部 X 光攝影（Chest PA）更易於偵測腹膜腔積氣